Clinical trial exclusion criterion:
expected to live under five years

Entity relations:
- Has_value("expected to live", "under five years")